Pregnant women between 34-42 weeks gestation

The above is a clinical trial inclusion criterion. Annotated with entity spans:
[Condition: Pregnant] [Person: women] [Value: between 34-42 weeks] [Measurement: gestation]